Proteinuria > 0,5 g/l;

The above is a clinical trial exclusion criterion. Annotated with entity spans:
[Condition: Proteinuria] [Multiplier: > 0,5 g/l];